Clinical trial inclusion criterion:
Previous post-exposure prophylaxis (PEP) use during the last 12 months.

Annotated entities:
- Procedure: "post-exposure prophylaxis use"
- Procedure: "PEP"
- Temporal: "during the last 12 months"